Patient's willingness to participate in the study

The above is a clinical trial inclusion criterion. Annotated with entity spans:
[Informed_consent: Patient's willingness to participate in the study]